63歲張女士，3個月前成人健檢報告顯示總膽固醇264 mg/dL，三酸甘油酯145 mg/dL，高密度脂蛋白膽固醇59 mg/dL，其它正常。張女士不抽菸，無其他疾病史，父親有糖尿病。複查結果低密度脂蛋白膽固醇150 mg/dL，血壓126/72 mmHg，身體質 量指數（BMI）30.1 kg/m2，下列敘述何者最適當？
A. 張女士屬於心血管疾病中度風險者（moderate risk）
B. 張女士之低密度脂蛋白膽固醇高於目標值
C. 此時只須繼續生活方式改善，不須給予statin類藥物治療
D. 須依Framingham Heart Study公式推估5年內罹患冠心症之風險值，才能決定張女士之膽固醇目標值

正確答案：C. 此時只須繼續生活方式改善，不須給予statin類藥物治療